Men and women older than 18 years, scheduled consecutively to perform a coronary procedure in the department of hemodynamics of the National Institute of Cardiology "Ignacio Chavez".

The above is a clinical trial inclusion criterion. Annotated with entity spans:
[Person: Men] and [Person: women] [Value: older than 18] [Person: years], [Mood: scheduled] consecutively to perform a [Procedure: coronary procedure] in the [Visit: department of hemodynamics] of [Visit: the National Institute of Cardiology "Ignacio Chavez"].